rituximab

The above is a clinical trial exclusion criterion. Annotated with entity spans:
[Drug: rituximab]